Clinical trial inclusion criterion:
Treated with a stable dose of one of the following for at least 3 months prior to screening: * >=1000 mg/day immediate-release metformin; or metformin >=1000 mg/day and sulfonylurea; or sulfonylurea/metformin combination therapy.

Annotated entities:
- Qualifier: "stable dose"
- Temporal: "at least 3 months prior to screening"
- Drug: "immediate-release metformin"
- Value: ">=1000 mg/day"
- Drug: "metformin"
- Value: ">=1000 mg/day"
- Drug: "sulfonylurea"
- Drug: "sulfonylurea"
- Drug: "metformin"
- Procedure: "combination therapy"
- Reference_point: "screening"
- Multiplier: "one of the following"